Clinical trial exclusion criterion:
Active bronchospasm or history of hospitalization due to bronchospasm

Annotated entities:
- Qualifier: "Active"
- Condition: "bronchospasm"
- Temporal: "history"
- Procedure: "hospitalization"
- Condition: "bronchospasm"